Currently taking 1 g or more of ascorbic acid supplementation daily

The above is a clinical trial exclusion criterion. Annotated with entity spans:
Currently taking [Multiplier: 1 g or more] of [Drug: ascorbic acid] supplementation daily